Clinical trial exclusion criterion:
Current dialysis treatment.

Entity relations:
- Has_temporal("dialysis treatment", "Current")